Clinical trial exclusion criterion:
9. Living or planned travel outside Montreal (> 1h of driving) area during closed-loop procedures.

Annotated entities:
- Parsing_Error: "9."
- Non-query-able: "Living or planned travel outside Montreal (> 1h of driving) area during closed-loop procedures."
- Procedure: "closed-loop procedures"
- Temporal: "during closed-loop procedures"
- Reference_point: "closed-loop procedures"